關於氣管造口術，下列敘述何者錯誤？
A. 其適應症包括分泌物多無法自咳、氣管阻塞、肺部功能不良需長期使用呼吸器
B. 常造口於胸骨上方第 5、6 節間的氣管軟骨環
C. 如長期氣管造口插管且充氣球硬度過高，可能造成氣管食道瘻管
D. 成人氣管之長度約為 10 至 13 公分，有 18 至 22 個軟骨環節

正確答案：B. 常造口於胸骨上方第 5、6 節間的氣管軟骨環